下列何種關節之化膿性感染必須緊急做手術引流，以避免發生骨頭壞死之併發症？
A. Knee
B. Ankle
C. Hip
D. Wrist

正確答案：C. Hip